Clinical trial exclusion criterion:
Hypersensitivity to ticagrelor

Annotated entities:
- Condition: "Hypersensitivity"
- Drug: "ticagrelor"